1. Cognitive impairment from mild to moderate degree defined by a Clinical Deterioration Rating (CDR) score range between 0.5 and 2.0.

The above is a clinical trial inclusion criterion. Annotated with entity spans:
[Parsing_Error: 1.] [Condition: Cognitive impairment] from [Qualifier: mild to moderate] degree defined by a [Measurement: Clinical Deterioration Rating (CDR) score] [Value: range between 0.5 and 2.0].